一位 3 歲女童自嬰兒期開始有多喝多尿的症狀。尿液檢測發現尿滲透度（urinary osmolality）數值低於 150 mOsm/kg、尿中之鈉離子濃度低於正常，該童之尿滲透度無法以限水或給予抗利尿激素的方式提高數值，下列何者是最可能之診斷？
A. 中樞性尿崩症（central diabetes insipidus）
B. 腎因性尿崩症（nephrogenic diabetes insipidus）
C. 慢性腎盂腎炎（chronic pyelonephritis）
D. 心因性尿崩症（psychogenic diabetes insipidus）

正確答案：B. 腎因性尿崩症（nephrogenic diabetes insipidus）